suffering major events or having mood swings.

The above is a clinical trial exclusion criterion. Annotated with entity spans:
suffering [Condition: major events] or having [Condition: mood swings].